Patients undergoing surgery with general anesthesia,

The above is a clinical trial inclusion criterion. Annotated with entity spans:
Patients [Temporal: undergoing] [Procedure: surgery] with [Qualifier: general anesthesia],